Patients receiving = 1 high or medium risk antibiotic for treatment of an infection other than CDI, for an anticipated duration of = 5 days from the time of enrollment.

The above is a clinical trial inclusion criterion. Annotated with entity spans:
[Non-query-able: Patients receiving = 1 high or medium risk antibiotic for treatment of an infection other than CDI, for an anticipated duration of = 5 days from the time of enrollment.]